外傷病人使用各種輸液及血液製品來復甦急救，其目的在於使人體各個組織都能得到充足組織灌流（tissue perfusion）。尿液的排出量為一客觀實用之定量指標，則下列何者為正確指標？
A. 成人大於1毫升／公斤（體重）／小時，小孩大於0.5 毫升／公斤（體重）／小時
B. 成人大於0.5毫升／公斤（體重）／小時，小孩大於1毫升／公斤（體重）／小時
C. 成人大於1毫升／公斤（體重）／小時，小孩大於1毫升／公斤（體重）／小時
D. 成人大於0.5毫升／公斤（體重）／小時，小孩大於0.5毫升／公斤（體重）／小時

正確答案：B. 成人大於0.5毫升／公斤（體重）／小時，小孩大於1毫升／公斤（體重）／小時